Según la normativa legal vigente, ¿cuál de las siguientes bacterias se emplea como parámetro microbiológico para poder calificar un agua como apta para el consumo humano?:
1. Clostridium perfringens
2. Salmonella enteritidis.
3. Vibrio cholerae.
4. Staphylococcus aureus.

Respuesta correcta: 1. Clostridium perfringens